Clinical trial exclusion criterion:
2. Screening tool: Wechsler Abbreviated Scale of Intelligence, Medical history, Adult ADHD Self-Report Scale.

Annotated entities:
- Parsing_Error: "2."
- Procedure: "Wechsler Abbreviated Scale of Intelligence"
- Temporal: "Medical history"
- Procedure: "Adult ADHD Self-Report Scale"
- Not_a_criteria: "Screening tool: Wechsler Abbreviated Scale of Intelligence, Medical history, Adult ADHD Self-Report Scale."